Clinical trial exclusion criterion:
Current pregnancy or lactation

Annotated entities:
- Condition: "pregnancy"
- Condition: "lactation"